La lipogénesis tiene lugar fundamentalmente en:
1. La mitocondria´.
2. El citosol.
3. Los peroxisomas.
4. Los lisosomas.
5. Las balsas lipídicas de las membranas.

Respuesta correcta: 2. El citosol.